Clinical trial exclusion criterion:
The participant has received transcranial magnetic stimulation within 6 months.The participant has received selegiline, pethidine, tramadol, reserpine or methyldopa within 90 days.

Annotated entities:
- Procedure: "transcranial magnetic stimulation"
- Temporal: "within 6 months"
- Drug: "selegiline"
- Drug: "pethidine"
- Drug: "tramadol"
- Drug: "reserpine"
- Drug: "methyldopa"
- Temporal: "within 90 days"
- Parsing_Error: "The participant has received transcranial magnetic stimulation within 6 months.The participant has received selegiline, pethidine, tramadol, reserpine or methyldopa within 90 days."